Clinical trial exclusion criterion:
Prior stroke

Annotated entities:
- Condition: "stroke"
- Temporal: "Prior"